阿斯匹靈是常用之解熱鎮痛藥劑，它主要是抑制下列那一項激素的產生？
A. Leukotriene
B. Testosterone
C. Insulin
D. Prostaglandin

正確答案：D. Prostaglandin